Patient aged 18 ans or more

The above is a clinical trial inclusion criterion. Annotated with entity spans:
Patient [Person: aged] [Value: 18 ans or more]